Clinical trial exclusion criteria:
Chronic opiate use
Liver disease (known history of hepatitis B or C, cirrhosis, nonalcoholic steatohepatitis, history of alcoholism, ALT/AST greater than 3 times upper limit of normal in the past 3 months)
Allergy/hypersensitivity to acetaminophen
Patients with baseline dementia
Chronic diathesis
Chronic kidney disease

Annotated entities:
- Multiplier: "Chronic"
- Drug: "opiate"
- Condition: "Liver disease"
- Temporal: "history"
- Condition: "hepatitis B"
- Condition: "hepatitis C"
- Condition: "cirrhosis"
- Condition: "nonalcoholic steatohepatitis"
- Temporal: "history"
- Condition: "alcoholism"
- Measurement: "ALT/AST"
- Value: "greater than 3 times upper limit of normal"
- Temporal: "in the past 3 months"
- Condition: "Allergy"
- Condition: "hypersensitivity"
- Drug: "acetaminophen"
- Temporal: "baseline"
- Condition: "dementia"
- Condition: "diathesis"
- Qualifier: "Chronic"
- Qualifier: "Chronic"
- Condition: "kidney disease"